low level of vitamin B12 and folate which are considered as clinically relevant

The above is a clinical trial exclusion criterion. Annotated with entity spans:
[Value: low] [Measurement: level of vitamin B12] and [Measurement: folate] which are considered as clinically relevant